間接的或稱為聽診的血壓測量法，其理論根據為何？
A. 層流所產生的音頻震盪（audible vibration）
B. 亂流所產生的音頻震盪
C. 層流所伴隨的靜音
D. 亂流所伴隨的靜音

正確答案：B. 亂流所產生的音頻震盪